Prior therapy with VEGFR inhibitors such as sorafenib and sunitinib;

The above is a clinical trial exclusion criterion. Annotated with entity spans:
Prior therapy with [Drug: VEGFR inhibitors] such as [Drug: sorafenib] and [Drug: sunitinib];